Clinical trial inclusion criterion:
Cases (with a history of TBI):

Annotated entities:
- Parsing_Error: "Cases (with a history of TBI):"